由翼腭神經節（pterygopalatine ganglion）所發出之節後纖維並不支配：
A. 瞳孔括約肌（sphincter pupillae）
B. 鼻腔黏液腺（mucous glands）
C. 軟腭之腭腺（palatine glands）
D. 淚腺（lacrimal gland）

正確答案：A. 瞳孔括約肌（sphincter pupillae）